Clinical trial inclusion criterion:
Able and willing to sign an informed consent.

Annotated entities:
- Post-eligibility: "Able and willing to sign an informed consent."